Clinical trial exclusion criterion:
Patients not scheduled for trans-jugular liver biopsy

Entity relations:
- Has_mood("trans-jugular liver biopsy", "scheduled")
- Has_negation("scheduled", "not")